Mujer de 53 años, que consulta por fiebre de 15 días de evolución, sin síntomas de focalidad infecciosa. En la exploración se detecta una hepatomegalia dolorosa a 5 cm del reborde costal y se palpa el bazo a 14 cm del reborde costal izquierdo. En el hemograma se aprecia Hb 8.5 g/dL, Leucocitos 630/ mL (linfocitos 63%, monocitos 20%, neutrófilos 17%) y plaquetas 35.000/mL. La bioquímica muestra una elevación moderada de la bioquímica hepática, LDH es normal y se observa en el proteinograma una hipergammaglobulinemia policlonal (3,5 g/ dL). Tiene antecedentes de infección por VIH conocida desde hace 10 años y adherencia irregular al tratamiento antiretroviral, con determinaciones recientes de linfocitos CD4 350 cel/mL y carga viral de VIH 154 copias/mL. Durante los últimos 3 meses ha estado tratada por poliartritis simétrica seronegativa con 10-20 mg/día de prednisona. ¿Cuál de las siguientes afirmaciones es correcta?
1. Realizaría una biopsia de médula ósea, ya que el diagnóstico más probable es una leishmaniasis visceral.
2. La pancitopenia se justifica por una cirrosis asociada al virus C y no realizaría más pruebas.
3. Probablemente se trate de una toxicidad medular por prednisona que trataría con retirada del fármaco y filgastrim.
4. Solicitaría una determinación de ANAs para descartar lupus sistémico diseminado.
5. Intensificaría el tratamiento antiretroviral, pues es probable que todas las manifestaciones que presenta se deban al VIH.

Respuesta correcta: 1. Realizaría una biopsia de médula ósea, ya que el diagnóstico más probable es una leishmaniasis visceral.